Other inflammatory Knee Osteoarthritis (e.g. gout, rheumatoid arthritis, etc.)

The above is a clinical trial exclusion criterion. Annotated with entity spans:
[Qualifier: Other] [Condition: inflammatory Knee Osteoarthritis] (e.g. [Condition: gout], [Condition: rheumatoid arthritis], etc.)